引起皮下幼蟲移行症（cutaneous larva migrans）的病原體是：
A. 蟯蟲（Enterobius vermicularis）
B. 鞭蟲（Trichuris trichiura）
C. 蛔蟲（Ascaris lumbricoides）
D. 巴西鈎蟲（Ancylostoma braziliense）

正確答案：D. 巴西鈎蟲（Ancylostoma braziliense）